四肢的骨折常伴隨其它損傷，下列合併損傷有那些是正確的？①肩胛骨骨折伴隨肺部挫傷  ②腰椎骨折伴隨腹內損傷  ③膝關節脫臼伴隨股動脈損傷  ④跟骨骨折伴隨脊椎骨折
A. ①②③
B. ②③④
C. ①③④
D. ①②④

正確答案：D. ①②④